有關誘發電位（evoked potentials, EP）是手術中常用的神經功能監測方式之敘述，下列何者錯誤？
A. 手術中常用的 EP 包括了聽覺（auditory）、體感覺（somatosensory）與運動（motor）等
B. 體感覺誘發電位（somatosensory evoked potentials, SSEPs）常用在脊椎損傷手術中，作為神經傳導功能的監測方式
C. 聽覺誘發電位（auditory evoked potentials, AEPs）則是常用在小腦橋腦角腫瘤（cerebello-pontine angle tumor）切除手術
D. 體感覺誘發電位（somatosensory evoked potentials, SSEPs）不會受到吸入性麻醉劑藥物或是低體溫的影響

正確答案：D. 體感覺誘發電位（somatosensory evoked potentials, SSEPs）不會受到吸入性麻醉劑藥物或是低體溫的影響